Clinical trial exclusion criterion:
Current tobacco use

Annotated entities:
- Observation: "tobacco use"
- Temporal: "Current"